下列關於 tumor antigens 的敘述，那一項錯誤？
A. 多數為 self-antigens
B. 可以是 tumor specific
C. 只會在腫瘤生長前期表現
D. 可以是突變的 self-antigens

正確答案：C. 只會在腫瘤生長前期表現